Clinical trial exclusion criterion:
Cardiopulmonary arrest

Annotated entities:
- Condition: "Cardiopulmonary arrest"